Clinical trial inclusion criterion:
C-peptide levels = 1.5 ng/mL

Entity relations:
- Has_value("C-peptide levels", "= 1.5 ng/mL")